Clinical trial exclusion criterion:
Contraindication to aspirin

Entity relations:
- AND("Contraindication", "aspirin")